Clinical trial exclusion criterion:
Patients' bone stock is compromised by disease or infection, which cannot provide adequate support and/or fixation to the prosthesis

Annotated entities:
- Non-query-able: "Patients' bone stock is compromised by disease or infection, which cannot provide adequate support and/or fixation to the prosthesis"